(relative) Known contraindications for initiation of eplerenone treatment (hyperkalemia, abnormal renal clearance, severe hepatic insufficiency (Child-Pugh C), type 2 diabetes mellitus with microalbuminuria, concomitant use of potassium supplements, potassium-sparing diuretics, strong CYP3A4 inhibitors, or the combination of an ACE-inhibitor and an angiotensin receptor blocking agent). Pregnancy will not be routinely tested in female patients, but the possibility of pregnancy will be discussed during screening;

The above is a clinical trial exclusion criterion. Annotated with entity spans:
(relative) Known [Condition: contraindications] for initiation of [Drug: eplerenone] treatment ([Condition: hyperkalemia], [Condition: abnormal renal clearance], [Condition: severe hepatic insufficiency] ([Measurement: Child-Pugh] [Value: C]), [Condition: type 2 diabetes mellitus] with [Condition: microalbuminuria], [Temporal: concomitant] use of [Drug: potassium supplements], [Drug: potassium-sparing diuretics], [Drug: strong CYP3A4 inhibitors], or the combination of an [Drug: ACE-inhibitor] and an [Drug: angiotensin receptor blocking agent]). [Non-representable: Pregnancy will not be routinely tested in female patients, but the possibility of pregnancy will be discussed during screening;]